Clinical trial inclusion criterion:
Endoscopic and surgical treatment to be provided by same team

Annotated entities:
- Procedure: "surgical treatment"
- Procedure: "Endoscopic treatment"